Clinical trial exclusion criterion:
Patients who plucked the upper eyebrow margin

Annotated entities:
- Condition: "plucked the upper eyebrow margin"